What cellular process is the protein clathrin involved in?

Clathrin plays a critical role in endocytosis and in doing so is crucial for maintaining cellular homeostasis